Which is the cellular target of gefitinib?

The specific cellular target of Gefitinib (Iressa) is the epidermal growth factor receptor (EGFR).